If lab results are available in the last 6 months, then a serum creatinine =1.3 mg/dL on 2 occasions during screening and/or follow-up, indicating potential impairment of renal functioning;

The above is a clinical trial exclusion criterion. Annotated with entity spans:
If lab results are available in the last 6 months, then a [Measurement: serum creatinine] [Value: =1.3 mg/dL] on [Multiplier: 2] occasions during screening and/or follow-up, indicating potential impairment of renal functioning;